2. Visual analog scale more than or equal to 4

The above is a clinical trial inclusion criterion. Annotated with entity spans:
2. [Measurement: Visual analog scale] [Value: more than or equal to 4]